Clinical trial inclusion criterion:
Platelet count greater than or equal to 40,000/mm^3

Annotated entities:
- Measurement: "Platelet count"
- Value: "greater than or equal to 40,000/mm^3"